Clinical trial inclusion criteria:
Cytologically proven acute lymphoblastic leukemia (ALL)
No relapse of a previously unrecognized ALL
Patients must meet one of the following risk criteria:
Standard-risk (SR) group meeting all of the following criteria:
Blasts < 1,000/µL in peripheral blood (PB) on day 8
Aged 1 to < 6 years
Initial WBC < 20,000/µL
M1 (5%) or M2 (= 5% to < 25%) blasts in bone marrow on day 15;
M1 marrow on day 33.
Aged < 1 or = 6 years and/or WBC = 20,000/µL
Blasts < 1,000/µL in PB on day 8
M1 or M2 marrow on day 15
M3 (= 25%) marrow on day 15 OR meets SR criteria but M3 marrow on day 15 and *M1 marrow on day 33.
Meets IR criteria and M3 marrow on day 15 (not SR and M3 on day 15)
Blasts = 1,000/µL in PB on day 8
M2 or M3 marrow on day 33
Translocation t(9;22) [BCR/ABL+] (Philadelphia chromosome-positive) or t(4;11) [MLL/AF4+].

Annotated entities:
- Condition: "acute lymphoblastic leukemia"
- Condition: "ALL"
- Qualifier: "Cytologically proven"
- Condition: "ALL"
- Qualifier: "previously unrecognized"
- Negation: "No"
- Condition: "relapse"
- Line: "Standard-risk (SR) group meeting all of the following criteria"
- Measurement: "Standard-risk"
- Measurement: "SR"
- Multiplier: "all"
- Measurement: "criteria"
- Line: "Blasts < 1,000/µL in peripheral blood (PB) on day 8"
- Measurement: "Blasts"
- Value: "< 1,000/µL"
- Qualifier: "peripheral blood"
- Qualifier: "PB"
- Temporal: "on day 8"
- Line: "Aged 1 to < 6 years"
- Person: "Aged"
- Value: "1 to < 6 years"
- Line: "Initial WBC < 20,000/µL"
- Measurement: "WBC"
- Qualifier: "Initial"
- Value: "< 20,000/µL"
- Line: "M1 (5%) or M2 (= 5% to < 25%) blasts in bone marrow on day 15"
- Measurement: "M1 blasts"
- Measurement: "M2 blasts"
- Qualifier: "bone marrow"
- Value: "(5%"
- Value: "= 5% to < 25%"
- Temporal: "on day 15"
- Line: "M1 marrow on day 33."
- Condition: "M1 marrow"
- Temporal: "on day 33"
- Line: "Aged < 1 or = 6 years and/or WBC = 20,000/µL"
- Person: "Aged"
- Value: "< 1 or = 6 years"
- Measurement: "WBC"
- Value: "= 20,000/µL"
- Line: "Blasts < 1,000/µL in PB on day 8"
- Measurement: "Blasts"
- Value: "< 1,000/µL"
- Condition: "PB"
- Temporal: "on day 8"
- Line: "M1 or M2 marrow on day 15"
- Condition: "M2 marrow"
- Condition: "M1 marrow"
- Temporal: "on day 15"
- Line: "M3 (= 25%) marrow on day 15 OR meets SR criteria but M3 marrow on day 15 and *M1 marrow on day 33"
- Condition: "M3 marrow"
- Value: "= 25%"
- Temporal: "on day 15"
- Measurement: "SR criteria"
- Value: "meets"
- Condition: "M3 marrow"
- Temporal: "on day 15"
- Condition: "M1 marrow"
- Temporal: "on day 33"
- Line: "Meets IR criteria and M3 marrow on day 15 (not SR and M3 on day 15)"
- Measurement: "IR criteria"
- Value: "Meets"
- Condition: "M3 marrow"
- Temporal: "on day 15"
- Value: "not"
- Measurement: "SR"
- Condition: "M3"
- Temporal: "on day 15"
- Line: "Blasts = 1,000/µL in PB on day 8"
- Measurement: "Blasts"
- Value: "= 1,000/µL"
- Qualifier: "PB"
- Temporal: "on day 8"
- Line: "M2 or M3 marrow on day 33"
- Condition: "M3 marrow"
- Condition: "M2 marrow"
- Temporal: "on day 33"
- Line: "Translocation t(9;22) [BCR/ABL+] (Philadelphia chromosome-positive) or t(4;11) [MLL/AF4+]"
- Measurement: "Translocation t(9;22)"
- Measurement: "BCR/ABL"
- Value: "+"
- Measurement: "Philadelphia chromosome"
- Value: "positive"
- Measurement: "t(4;11)"
- Measurement: "MLL/AF4"
- Value: "+"